Likely source to be from (proven or suspected at the time of randomisation) the central nervous system, e.g. brain abscess, post-surgical meningitis, shunt infection (due to concerns over CNS penetration of piperacillin/tazobactam)

The above is a clinical trial exclusion criterion. Annotated with entity spans:
Likely source to be from (proven or suspected at the time of randomisation) the central nervous system, e.g. [Condition: brain abscess], [Qualifier: post-surgical] [Condition: meningitis], [Condition: shunt infection] (due to concerns over CNS penetration of piperacillin/tazobactam)